Clinical trial exclusion criterion:
Hemoglobin concentration under 6.5 mmol/l screening

Entity relations:
- Has_value("Hemoglobin concentration", "under 6.5 mmol/l")